下列有關老年人上樓梯及由坐椅站起（sit-to-stand）之時間影響因子，何者最為重要？
A. 髖關伸展（hip extension）
B. 足踝蹠屈（ankle plantaflexion）
C. 骨盤旋轉（pelvic rotation）
D. 足踝背屈（ankle dorsiflexion）

正確答案：D. 足踝背屈（ankle dorsiflexion）